Serum total bilirubin > 3 times the upper limit of normal at screening.

The above is a clinical trial exclusion criterion. Annotated with entity spans:
[Measurement: Serum total bilirubin] [Value: > 3 times the upper limit of normal] [Temporal: at screening].